History of open bladder, rectosigmoid colon, or other pelvic surgery

The above is a clinical trial exclusion criterion. Annotated with entity spans:
History of [Procedure: open bladder], [Procedure: rectosigmoid colon], or other [Procedure: pelvic surgery]